Las enzimas presentes en el interior del virión de los poxvirus son necesarias para la replicación de su material genético porque:
1. Su genoma es DNA monocatenario (-).
2. Su genoma es RNA monocatenario (-).
3. Se replican en el citoplasma celular.
4. Contiene un porcentaje muy elevado de bases nitrogenadas inusuales como la inosina.
5. Al inicio de la infección se produce un bloqueo del sistema transcripcional de la célula huésped.

Respuesta correcta: 3. Se replican en el citoplasma celular.